Clinical trial exclusion criterion:
10. Acute decompensated heart failure.

Annotated entities:
- Parsing_Error: "10."
- Condition: "Acute decompensated heart failure"